Clinical trial exclusion criterion:
antibiotic use in the last 7 days

Annotated entities:
- Drug: "antibiotic"
- Temporal: "last 7 days"